Complicated (effusion, empyema or abscess) pneumonia, including tuberculosis

The above is a clinical trial exclusion criterion. Annotated with entity spans:
[Condition: Complicated] ([Condition: effusion], [Condition: empyema] or [Condition: abscess]) pneumonia, including [Condition: tuberculosis]